Clinical trial exclusion criterion:
Known or suspected (or history of) malignancy or chronic illness.

Entity relations:
- Has_mood("malignancy", "Known")
- OR("Known", "suspected")
- OR("malignancy", "chronic illness")